Clinical trial exclusion criterion:
Most recent hCG > 5000 mIU/mL

Entity relations:
- Has_value("hCG", "> 5000 mIU/mL")
- Has_temporal("hCG", "Most recent")